¿Cuál es la afirmación correcta acerca de la prevalencia de la depresión en la infancia y la adolescencia?:
1. Entre los 6 y los 12 años la prevalencia es muy superior en las niñas.
2. En la adolescencia, la depresión es mucho más frecuente en las chicas que en los chicos.
3. En la adolescencia, la depresión tiene una prevalencia muy similar en las chicas y en los chicos.
4. La prevalencia de la depresión es similar en los adolescentes y en los niños más pequeños.

Respuesta correcta: 2. En la adolescencia, la depresión es mucho más frecuente en las chicas que en los chicos.